Malignancies (<5 years)

The above is a clinical trial exclusion criterion. Annotated with entity spans:
[Condition: Malignancies] ([Temporal: <5 years])